Clinical trial inclusion criteria:
T1DM for at least 12 months
persistent HbA1c levels = 7.5% (58 mmol/mol) despite optimized education therapy,
recurrent severe hypoglycemic episodes or high glucose variability
willingness to wear the insulin pump

Annotated entities:
- Condition: "T1DM"
- Temporal: "for at least 12 months"
- Measurement: "HbA1c levels"
- Multiplier: "persistent"
- Value: "= 7.5%"
- Value: "58 mmol/mol"
- Procedure: "optimized education therapy"
- Multiplier: "recurrent"
- Qualifier: "severe"
- Condition: "hypoglycemic episodes"
- Condition: "high glucose variability"
- Mood: "willingness"
- Procedure: "wear the insulin pump"
- Device: "insulin pump"